Las transiciones entre niveles de energía electrónica que implican radiación electromagnética en el intervalo de 200 a 800 nm forman la base de la espectroscopía de:
1. Infrarrojo.
2. Ultravioleta-Visible.
3. Resonancia Magnética Nuclear.
4. Raman.

Respuesta correcta: 2. Ultravioleta-Visible.